Clinical trial inclusion criterion:
Adult men who have sex with men, and transgender women

Annotated entities:
- Person: "Adult"
- Person: "men who have sex with men"
- Person: "transgender women"